60歲的李先生，抽菸數十年，8年前因鼻咽癌而接受放射治療，定期追蹤均無腫瘤復發，最近一年來有頭暈現象，三天前出現左手及左腳突然無力，持續30分鐘才恢復，下列處置何者為最優先？
A. 頸部聽診及杜卜勒超音波檢查
B. 電腦斷層檢查頸椎是否有壓迫
C. 臨床檢查是否有鼻咽腫瘤局部復發
D. 全身核醫檢查及排除是否有其他轉移

正確答案：A. 頸部聽診及杜卜勒超音波檢查